Patients taking Clonidine

The above is a clinical trial exclusion criterion. Annotated with entity spans:
Patients taking [Drug: Clonidine]